Use of other investigational drugs 30 days prior to the date of randomization

The above is a clinical trial exclusion criterion. Annotated with entity spans:
Use of [Drug: other investigational drugs] [Temporal: 30 days prior to the date of randomization]